尿中出現過量的 amino acids 及 glucose 的病人，最有可能的腎臟病變是在何處？
A. 近端小管（proximal tubule）
B. 亨利氏環下行支（descending limb of Henle's loop）
C. 亨利氏環上行支（ascending limb of Henle's loop）
D. 集尿管（collecting duct）

正確答案：A. 近端小管（proximal tubule）